aged 18 to 40 years.

The above is a clinical trial inclusion criterion. Annotated with entity spans:
[Person: aged] [Value: 18 to 40 years].